Use of oral steroids or non-steroidal anti-inflammatory agents other than aspirin within 72 hours or 3 times the agent's half-life (whichever is longer)

The above is a clinical trial exclusion criterion. Annotated with entity spans:
Use of [Drug: oral steroids] or [Drug: non-steroidal anti-inflammatory agents] [Negation: other than] [Drug: aspirin] [Temporal: within 72 hours] or [Reference_point: 3 times the agent's half-life] (whichever is longer)